Clinical trial inclusion criterion:
Non-traumatic LBP: no substantial and direct trauma to the back within the previous month

Annotated entities:
- Condition: "LBP"
- Qualifier: "Non-traumatic"
- Qualifier: "direct"
- Qualifier: "substantial"
- Condition: "trauma"
- Negation: "no"
- Qualifier: "back"
- Temporal: "within the previous month"